Clinical trial exclusion criterion:
Prior anti-epidermal growth factor receptor (EGFr) antibody therapy (e.g., panitumumab or cetuximab) or treatment with small molecule EGFr inhibitors (e.g., gefitinib, erlotinib, lapatinib).

Entity relations:
- Subsumes("anti-epidermal growth factor receptor antibody therapy", "panitumumab")
- Subsumes("anti-epidermal growth factor receptor antibody therapy", "EGFr")
- Subsumes("treatment with small molecule EGFr inhibitors", "gefitinib")
- OR("panitumumab", "cetuximab")
- OR("gefitinib", "erlotinib", "lapatinib")
- OR("anti-epidermal growth factor receptor antibody therapy", "treatment with small molecule EGFr inhibitors")